Clinical trial exclusion criterion:
Pregnant (or anticipate pregnancy during the study period) or lactating women

Annotated entities:
- Condition: "Pregnant"
- Condition: "lactating"
- Person: "women"
- Mood: "anticipate during the study period"
- Condition: "pregnancy"